P. Lewinson, en su teoría sobre la depresión, postula que los responsables primarios de dicho trastorno son:
1. Los factores ambientales.
2. Los factores hereditarios.
3. La inseguridad en uno mismo.
4. El déficit en las conductas de autobservación.

Respuesta correcta: 1. Los factores ambientales.